psychiatric conditions such as schizophrenia, adult ADHD, or bipolar disorder

The above is a clinical trial exclusion criterion. Annotated with entity spans:
[Condition: psychiatric conditions] such as [Condition: schizophrenia], [Condition: adult ADHD], or [Condition: bipolar disorder]